What is the function of the TFIIS transcriptional factor (Dst1) in yeast?

TFIIS, an elongation factor encoded by DST1 in Saccharomyces cerevisiae, stimulates transcript cleavage in arrested RNA polymerase II.